Clinical trial inclusion criterion:
stable HbA1c (± 0.5%) for at least 12 weeks

Annotated entities:
- Measurement: "HbA1c"
- Value: "± 0.5%"
- Temporal: "at least 12 weeks"